Clinical trial inclusion criterion:
Pediatric patients with deep dental decay in primary molars

Annotated entities:
- Person: "Pediatric"
- Condition: "deep dental decay"
- Qualifier: "primary molars"